Clinical trial exclusion criterion:
Patients with active tumor lysis syndrome (TLS) either from laboratory or clinical changes.

Annotated entities:
- Condition: "tumor lysis syndrome (TLS)"